Retransplantation

The above is a clinical trial exclusion criterion. Annotated with entity spans:
[Condition: Retransplantation]